Clinical trial exclusion criterion:
Cancers other than basal cell skin cancers within the last 5 years

Entity relations:
- Has_temporal("basal cell skin cancers", "within the last 5 years")
- Has_negation("basal cell skin cancers", "other than")
- AND("Cancers", "basal cell skin cancers")